Caucasian male or female patient

The above is a clinical trial inclusion criterion. Annotated with entity spans:
[Person: Caucasian] [Person: male] or [Person: female] patient